Clinical trial inclusion criterion:
PSA = 2 ng/mL at screening

Annotated entities:
- Measurement: "PSA"
- Value: "= 2 ng/mL"